Patients with an active or suspected latent infection in or about the knee joint

The above is a clinical trial exclusion criterion. Annotated with entity spans:
Patients with an active or suspected latent [Condition: infection] in or about the [Qualifier: knee joint]